6. Concurrent use of any testosterone, progestin, androgen, estrogen, anabolic steroids, DHEA or hormonal products for at least 2 weeks prior to screening and during the study.

The above is a clinical trial exclusion criterion. Annotated with entity spans:
[Parsing_Error: 6.] Concurrent use of any [Drug: testosterone], [Drug: progestin], [Drug: androgen], [Drug: estrogen], [Drug: anabolic steroids], [Drug: DHEA] or [Drug: hormonal products] [Temporal: for at least 2 weeks prior to screening] and [Temporal: during the study].